Healthy Volunteers:

The above is a clinical trial inclusion criterion. Annotated with entity spans:
[Parsing_Error: Healthy Volunteers:]